金黃色葡萄球菌之外表具有與免疫球蛋白之 Fc 部分結合的構造，可防止宿主之吞噬，則此物質為何？
A. M 蛋白質
B. 蛋白質 A
C. 脂多醣體
D. IgA 蛋白質

正確答案：B. 蛋白質 A